Clinical trial inclusion criterion:
Adults over 18 years of age

Entity relations:
- Has_value("age", "over 18 years of age")